Alcohol and other drug abuse cases based on 6 months before screening.

The above is a clinical trial exclusion criterion. Annotated with entity spans:
[Condition: Alcohol] and other [Condition: drug abuse] cases based on [Temporal: 6 months before screening].